Clinical trial inclusion criterion:
4. Diagnosis of HMB based on the medical judgment of the principal or site investigator

Annotated entities:
- Condition: "HMB"
- Non-query-able: "based on the medical judgment of the principal or site investigator"
- Subjective_judgement: "based on the medical judgment of the principal or site investigator"